List the main PPI databases.

PPIM,
HPRD,
STRING,
DAPID,
MIPS,
INTERACT,
BioGRID